acute lower extremity ischemic event secondary to thromboembolic disease or acute trauma,

The above is a clinical trial exclusion criterion. Annotated with entity spans:
[Qualifier: acute] [Qualifier: lower extremity] [Condition: ischemic event] [Qualifier: secondary to thromboembolic disease] or [Condition: acute trauma],